En el apartado de Resultados de un informe de investigación, debemos:
1. Reflejar los datos resumidos y los resultados de los análisis estadísticos.
2. Reproducir los datos brutos del estudio para permitir comprobaciones externas.
3. Relacionar los resultados de los análisis con las hipótesis de trabajo y con otras investigaciones del campo de estudio.
4. Describir cómo se ha realizado la investigación para garantizar su replicabilidad.

Respuesta correcta: 1. Reflejar los datos resumidos y los resultados de los análisis estadísticos.